ASA 1 & 2

The above is a clinical trial inclusion criterion. Annotated with entity spans:
[Measurement: ASA] [Value: 1 & 2]